Reslizumab is a humanized monoclonal antibody to treat what specific type of asthma?

Reslizumab is a humanized monoclonal antibody to treat eosinophilic asthma